Patients who are unable or do not have the necessary assistance to operate the patient remote

The above is a clinical trial exclusion criterion. Annotated with entity spans:
[Non-query-able: Patients who are unable or do not have the necessary assistance to operate the patient remote]